下列何種病毒，最不會經由性接觸而傳染？
A. 第一型人類嗜Ｔ淋巴球病毒（Human T-cell lymphotropic virus-1, HTLV-1）
B. 巨細胞病毒（Cytomegalovirus, CMV）
C. A型肝炎病毒（Hepatitis A virus, HAV）
D. C型肝炎病毒（Hepatitis C virus, HCV）

正確答案：C. A型肝炎病毒（Hepatitis A virus, HAV）